1. Had a diagnosis of PHN, DN, CRPS, carpal tunnel syndrome, HIV neuropathy, idiopathic sensory neuropathy, or other peripheral neuropathy (upon mutual agreement of the sponsor and investigator)

The above is a clinical trial inclusion criterion. Annotated with entity spans:
1. Had a diagnosis of [Condition: PHN], [Condition: DN], [Condition: CRPS], [Condition: carpal tunnel syndrome], [Condition: HIV neuropathy], [Qualifier: idiopathic] [Condition: sensory neuropathy], or other [Condition: peripheral neuropathy] ([Subjective_judgement: upon mutual agreement of the sponsor and investigator])